Clinical trial inclusion criterion:
Intra-uterine pregnancy

Annotated entities:
- Condition: "Intra-uterine pregnancy"